La RNA Polimerasa I transcribe:
1. Los genes de los precursores de los mRNAs.
2. El gen precursor de los RNAs ribosómicos 18S, 5,8S y 28S.
3. Los genes de los precursores de los RNAs de transferencia.
4. Los RNAs catalíticos.

Respuesta correcta: 2. El gen precursor de los RNAs ribosómicos 18S, 5,8S y 28S.